Clinical trial exclusion criterion:
Presence of psychiatric disorder or intake of anti-depressive or anti-psychotic agents with the exception of benzodiazepines and SSRIs/SNRI's (selective serotonin reuptake inhibitor)

Annotated entities:
- Condition: "psychiatric disorder"
- Drug: "anti-depressive agents"
- Drug: "anti-psychotic agents"
- Negation: "with the exception of"
- Drug: "benzodiazepines"
- Drug: "SSRIs"
- Drug: "SNRI's"